下列何者不是肥胖症（obesity）孕婦容易發生的孕期母胎合併症（complications）？
A. 妊娠糖尿病（gestational diabetes mellitus）
B. 子癇前症（preeclampsia）
C. 過期妊娠（postterm pregnancy）
D. 早期破水（preterm rupture of membranes）

正確答案：D. 早期破水（preterm rupture of membranes）